Clinical trial inclusion criterion:
Child-Pugh grade in A-level;

Entity relations:
- Has_value("Child-Pugh grade", "A")